Clinical trial exclusion criterion:
Platelet count higher than 30x109/l at time of screening

Annotated entities:
- Measurement: "Platelet count"
- Value: "higher than 30x109/l"
- Temporal: "at time of screening"
- Reference_point: "screening"